Anticipated TPN treatment for at least one month

The above is a clinical trial inclusion criterion. Annotated with entity spans:
Anticipated [Procedure: TPN treatment] [Multiplier: for at least one month]